Patients with abnormal hematology or serum chemistry lab results

The above is a clinical trial exclusion criterion. Annotated with entity spans:
Patients with [Value: abnormal] [Measurement: hematology] or [Measurement: serum chemistry lab] results